有關兒童背痛症之敘述，下列何者錯誤？
A. 病毒感染是經常伴隨發生的因素之一
B. 在學齡前的兒童極為常見
C. 當合併出現皮膚病變，如痣、異常長毛或色素沈澱時，須考慮可能有椎管閉合不全症（spinal dysraphism）
D. 當C反應性蛋白（C-reactive protein）異常時，須考慮細菌感染、類風濕疾病與腫瘤等

正確答案：B. 在學齡前的兒童極為常見